Clinical trial exclusion criterion:
Thrombolytic therapy within 24 hours before randomization

Annotated entities:
- Procedure: "Thrombolytic therapy"
- Temporal: "within 24 hours before randomization"
- Reference_point: "randomization"